receiving bismuth salts, PPIs, or antibiotics in the previous month.

The above is a clinical trial exclusion criterion. Annotated with entity spans:
receiving [Drug: bismuth salts], [Drug: PPIs], or [Drug: antibiotics] [Temporal: in the previous month].